Clinical trial exclusion criterion:
Uncorrected hypokalemia or hyperkalemia (potassium <3.5 mmol/l or >5.5 mmol/l).

Entity relations:
- Has_value("potassium", "<3.5 mmol/l")
- Subsumes("hypokalemia", "<3.5 mmol/l")
- OR("hypokalemia", "hyperkalemia")
- OR("<3.5 mmol/l", ">5.5 mmol/l")